一位 33 歲男性，兩週前出國時曾有性接觸，求診前兩天生殖器開始有群聚性水疱，下列何種檢查可以提供最快速的診斷？
A. KOH preparation
B. Tzanck smear
C. Gram stain
D. VDRL

正確答案：B. Tzanck smear